有關精神疾病與其首選藥物之配對，下列何者正確？
A. 思覺失調症（schizophrenia）─ serotonin and dopamine agonists
B. 廣泛性焦慮症（generalized anxiety disorders）─ selective serotonin reuptake inhibitors
C. 雙極性情感疾患（bipolar disorders）─ dopamine agonists
D. 強迫症（obsessive compulsive disorders）─ lithium

正確答案：B. 廣泛性焦慮症（generalized anxiety disorders）─ selective serotonin reuptake inhibitors